Acute kidney injury, defined as increase in S-creatinine 50% or 27 mol/L

The above is a clinical trial inclusion criterion. Annotated with entity spans:
[Condition: Acute kidney injury], defined as [Measurement: increase in S-creatinine] [Value: 50% or 27 mol/L]